當加護病房病人病情急驟惡化，將面臨往生的過程，醫師應協助家屬面對目前的狀況以接受死亡。 下列何種方式能讓個案或家屬得到較好的照顧？
A. 請家屬先到外面等待，儘可能的急救病人
B. 急救過程中依家屬要求，儘量急救到要求的時間再停止
C. 急救中讓家屬了解急救成功機率不大，請家屬先接受親人即將往生的事實，並試著讓家屬與病人道別
D. 急救 30 分鐘後，請家屬進來宣布死亡事實，請家屬先離開，協助屍體護理後，再由往生室送出病人

正確答案：C. 急救中讓家屬了解急救成功機率不大，請家屬先接受親人即將往生的事實，並試著讓家屬與病人道別